下列何種運動不是屬於開放性動力鏈的運動（open kinetic chain exercise）？
A. 半蹲的動作（minisquat）
B. 平躺時作股四頭肌等長性運動（quadriceps setting）
C. 直腿抬舉運動（straight leg raising）
D. 足部騰空的膝部關節運動（knee ROM exercise）

正確答案：A. 半蹲的動作（minisquat）